Treating surgeon has recommended surgical repair of the aneurysm

The above is a clinical trial inclusion criterion. Annotated with entity spans:
[Qualifier: Treating surgeon] has [Mood: recommended] [Procedure: surgical repair] of the [Condition: aneurysm]